¿Cuál de las siguientes moléculas facilita la unión de los linfocitos T a las paredes endoteliales?:
1. Beta2-microglobulina.
2. Selectina L.
3. TLR-9.
4. NF-kB.

Respuesta correcta: 2. Selectina L.